Clinical trial exclusion criterion:
presence of ferrous-containing metals within the body (e.g., aneurysm clips, shrapnel/retained particles)

Entity relations:
- Subsumes("ferrous-containing metals", "aneurysm clips")
- OR("aneurysm clips", "shrapnel", "retained particles")